Which drug can be reversed with idarucizumab?

Idarucizumab is an antibody fragment that specifically reverses dabigatran mediated anticoagulation.